Clinical trial exclusion criterion:
Symptomatic hypotension.

Annotated entities:
- Qualifier: "Symptomatic"
- Condition: "hypotension"